Clinical trial exclusion criterion:
Intra uterine device (IUD)

Annotated entities:
- Device: "Intra uterine device (IUD)"